Clinical trial inclusion criterion:
Patients should have been off other investigational antineoplastic therapy for one month prior to entry in this study.

Annotated entities:
- Post-eligibility: "Patients should have been off other investigational antineoplastic therapy for one month prior to entry in this study."
- Procedure: "antineoplastic therapy"
- Negation: "been off"
- Temporal: "for one month prior to entry in this study"
- Reference_point: "entry in this study"